下列關於使用輪椅的敘述，何者最正確？
A. 輪椅座椅的高度（seat height），由腳跟底面至髕骨頂端而加 2 英吋
B. 單側偏癱之腦中風患者，必須要使用有可拆開式扶手的輪椅
C. 輪椅椅背的高度（back height），由椅面至肩胛骨下緣再加 2 英吋
D. 適合輪椅使用的斜坡道，其斜率應在 1/12 以下

正確答案：D. 適合輪椅使用的斜坡道，其斜率應在 1/12 以下